Clinical trial exclusion criterion:
Patients with a history of anaphylactic allergy to eggs or egg products, manifested by one or more of the following symptoms: generalized urticaria, difficulty in breathing, swelling of the mouth and throat, hypotension, or shock. (Subjects with nonanaphylactic allergies to eggs or egg products may be enrolled in the study, but must be watched carefully for 1 h following the administration of SONAZOID).

Entity relations:
- AND("anaphylactic allergy", "eggs")
- Subsumes("anaphylactic allergy", "generalized urticaria")
- OR("eggs", "egg products")
- OR("generalized urticaria", "hypotension", "swelling of the throat", "swelling of the mouth", "difficulty in breathing", "shock")